A known bleeding diathesis, hemostatic or coagulation disorder, or prior major bleeding

The above is a clinical trial exclusion criterion. Annotated with entity spans:
A known [Condition: bleeding diathesis], [Condition: hemostatic] or [Condition: coagulation disorder], or [Temporal: prior] [Condition: major bleeding]